Clinical trial exclusion criterion:
The difference in blood pressure between the selected arm versus non-selected arm is = 20 mmHg for siSBP and = 10 mmHg for siDBP at Visit 1 (screening).

Annotated entities:
- Measurement: "difference in blood pressure"
- Qualifier: "selected arm versus non-selected arm"
- Value: "= 20 mmHg"
- Value: "= 10 mmHg"
- Measurement: "siDBP"
- Measurement: "siSBP"
- Temporal: "at Visit 1"